一位 78 歲老先生，二週前下車時，不慎頭部撞到車門，近日感覺右側肢體力量變差，最可能的診斷為：
A. 硬腦膜上腔出血（epidural hematoma）
B. 硬腦膜下腔出血（subdural hematoma）
C. 蜘蛛網膜下腔出血（subarachnoid hemorrhage）
D. 腦室出血（intraventricular hemorrhage）

正確答案：B. 硬腦膜下腔出血（subdural hematoma）